Clinical trial exclusion criterion:
undergoing anterior spine multi-level instrumentation surgery

Annotated entities:
- Qualifier: "anterior spine"
- Procedure: "multi-level instrumentation surgery"
- Temporal: "undergoing"